Clinical trial exclusion criterion:
Current IUD

Annotated entities:
- Procedure: "IUD"